Los capilares continuos son típicos de:
1. Sistema nervioso central.
2. Hígado.
3. Glándulas.
4. Riñón.
5. Tubo digestivo.

Respuesta correcta: 1. Sistema nervioso central.